Clinical trial exclusion criterion:
Known. acyanotic congenital heart disease or children after cardiac interventional procedures for follow-up examination.

Entity relations:
- multi("cardiac interventional procedures", "cardiac interventional procedures")
- AND("after cardiac interventional procedures", "cardiac interventional procedures")
- Has_qualifier("cardiac interventional procedures", "for follow-up examination")
- multi("for follow-up examination", "follow-up examination")
- Has_index("after cardiac interventional procedures", "cardiac interventional procedures")
- OR("acyanotic congenital heart disease", "cardiac interventional procedures")